Where is the yeast transpozable element Ty3 preferentially inserted?

The retrovirus-like element Ty3 of Saccharomyces cerevisiae integrates at the transcription initiation region of RNA polymerase III